關於急性會厭炎（acute epiglottitis）之敘述，以下何者錯誤？
A. 最常見之致病菌為 B 型嗜血桿菌（H. influenzae B）
B. 頸部 X 光呈現"steeple sign＂
C. 可能造成上呼吸道阻塞
D. 治療首重呼吸道之建立

正確答案：B. 頸部 X 光呈現"steeple sign＂